翼腭窩（pterygopalatine fossa）的後上方通往何處？
A. 鼻腔
B. 顳下窩（infratemporal fossa）
C. 中顱窩（middle cranial fossa）
D. 口腔

正確答案：C. 中顱窩（middle cranial fossa）